What is the difference between COG133 and COG112?

COG112 results from the fusion of COG133 to a protein transduction domain.